Clinical trial inclusion criterion:
Extension of local tumor to involve adjacent organs other than seminal vesicles (T4)

Annotated entities:
- Condition: "Extension of local tumor"
- Qualifier: "adjacent organs"
- Negation: "other than"
- Qualifier: "seminal vesicles"